關於間皮瘤（mesothelioma）的敘述，下列何者正確？
A. peritoneal mesothelioma比pleural mesothelioma較常見
B. pleural fluid或ascites之cytology，通常就足以診斷
C. 預後良好，中位數存活期（median overall survival）為3年
D. 少部分的間皮瘤（mesothelioma）為良性

正確答案：D. 少部分的間皮瘤（mesothelioma）為良性